Clinical trial exclusion criterion:
Any suicidal ideation with intent with or without a plan, at the time of or within 6 months of Screening, as indicated by answering "Yes" to questions 4 or 5 on the Suicidal Ideation section of the Columbia-Suicide Severity Rating Scale (C-SSRS)

Entity relations:
- Has_qualifier("suicidal ideation", "with intent")
- Has_qualifier("suicidal ideation", "with a plan")
- Has_temporal("suicidal ideation", "at the time of Screening")
- Has_value("questions 4", "Yes")
- AND("Suicidal Ideation section of the Columbia-Suicide Severity Rating Scale (C-SSRS)", "questions 4")
- AND("suicidal ideation", "Suicidal Ideation section of the Columbia-Suicide Severity Rating Scale (C-SSRS)")
- OR("with a plan", "without a plan")
- OR("at the time of Screening", "within 6 months of Screening")
- OR("questions 4", "questions 5")